下列那一種urinary incontinence於女性最常見？
A. 急迫性尿失禁（urge urinary incontinence）
B. 應力性尿失禁（stress urinary incontinence）
C. 混合型尿失禁（mixed incontinence）
D. 溢流型尿失禁（overflow incontinence）

正確答案：B. 應力性尿失禁（stress urinary incontinence）